24 歲女性，兩側甲狀腺腫大，超音波檢查兩葉皆呈現低回音，細胞學檢查以淋巴球為主，無甲狀腺機能亢進或低下之症狀，則下列何者錯誤？
A. 可以使用甲狀腺素治療
B. 不可吃含碘的食物
C. 若出現心律不整，最好使用 amiodarone
D. 生產後甲狀腺腫可能變大

正確答案：C. 若出現心律不整，最好使用 amiodarone